M1 marrow on day 33.

The above is a clinical trial inclusion criterion. Annotated with entity spans:
[Line: M1 marrow on day 33.]